下列何者不是atropine的臨床用途？
A. 治療狹角青光眼
B. 使眼睛睫狀肌麻痺
C. 手術時減少支氣管分泌
D. 急性有機磷中毒之解救

正確答案：A. 治療狹角青光眼